Clinical trial inclusion criterion:
7. In the absence of the use of exogenous hormone(s), have a self-reported regular menstrual cycle defined as having a minimum of 21 days and a maximum of 36 days between menses

Annotated entities:
- Drug: "exogenous hormone"
- Negation: "absence"
- Value: "regular"
- Measurement: "menstrual cycle"
- Condition: "regular menstrual cycle"
- Value: "minimum of 21 days"
- Value: "maximum of 36 days"